En el cerebelo, tiene función específica sobre el control de la postura:
1. El núcleo dentado.
2. Las áreas laterales de los hemisferios cerebelosos.
3. El núcleo intermedio.
4. El lóbulo floculonodular.

Respuesta correcta: 4. El lóbulo floculonodular.